關於乾癬（psoriasis）的敘述，下列何者錯誤？
A. Auspitz's sign 為其特點
B. 有 Koebner phenomenon
C. 滴狀乾癬（guttate psoriasis）多為金黃色葡萄球菌感染所引發
D. 某些藥物例如β-blocker 會加重乾癬的病情

正確答案：C. 滴狀乾癬（guttate psoriasis）多為金黃色葡萄球菌感染所引發